Clinical trial exclusion criterion:
Known or suspected (or history of) malignancy or chronic illness.

Annotated entities:
- Mood: "suspected"
- Mood: "Known"
- Condition: "malignancy"
- Condition: "chronic illness"
- Temporal: "history of"